Clinical trial exclusion criterion:
7. Unable to give informed consent

Annotated entities:
- Parsing_Error: "7."
- Observation: "informed consent"